Angiographically confirmed acute massive pulmonary embolism with involvement of Central pulmonary arteries.

The above is a clinical trial inclusion criterion. Annotated with entity spans:
[Qualifier: Angiographically confirmed] [Qualifier: acute] [Qualifier: massive] [Condition: pulmonary embolism] with [Condition: involvement of Central pulmonary arteries].